La glucosa aparece en orina:
1. Siempre.
2. Cuando la cantidad de glucosa filtrada supera su transporte tubular máximo.
3. Cuando se filtra y se segrega de forma activa.
4. En la diabetes insípida.

Respuesta correcta: 2. Cuando la cantidad de glucosa filtrada supera su transporte tubular máximo.